下列有關肺癌之敘述，何者正確？
A. 吸菸是罹患肺癌的主要原因之一，戒菸超過二十五年後罹癌的機率即與不吸菸者相仿
B. 為台灣癌症十大死因之首，為女性死因之第二位，男性死因之第一位
C. 肺癌罹病率由 45 歲後逐步攀升，且男性較女性為高
D. 目前對於肺癌的治療方式都無法改善其存活率，故應採取保守治療

正確答案：C. 肺癌罹病率由 45 歲後逐步攀升，且男性較女性為高